known chronic diarrheal disease (celiac disease, lactose malabsorption, Inflammatory bowel diseases, incl microscopic colitis)

The above is a clinical trial exclusion criterion. Annotated with entity spans:
known [Condition: chronic diarrheal disease] ([Condition: celiac disease], [Condition: lactose malabsorption], [Condition: Inflammatory bowel diseases], incl [Condition: microscopic colitis])